Which R packages have been developed for the discovery of mutational signatures in cancer?

signeR: an empirical Bayesian approach to mutational signature discovery.